下列何種情況下，左心室心輸出量（cardiac output）會減少？
A. 吃飯
B. 運動
C. 氣溫升高
D. 從平躺站立起來

正確答案：D. 從平躺站立起來